Subject has chronic obstructive pulmonary disease with detected pulmonary hypertension or any other evidence of significant lung disease.

The above is a clinical trial exclusion criterion. Annotated with entity spans:
Subject has [Condition: chronic obstructive pulmonary disease] with detected [Condition: pulmonary hypertension] or any other evidence of [Qualifier: significant] [Condition: lung disease].